Known subjects with renal, liver, calcium metabolism disorders, malabsorption disorders, known neoplasms.

The above is a clinical trial exclusion criterion. Annotated with entity spans:
Known subjects with renal, liver, [Condition: calcium metabolism disorders], [Condition: malabsorption disorders], known [Condition: neoplasms].